Clinical trial inclusion criterion:
Kidney transplant recipients at Washington University/Barnes-Jewish Hospital

Entity relations:
- AND("Kidney transplant", "Washington University/Barnes-Jewish Hospital")